Clinical trial exclusion criterion:
Allergy to narcotic medications

Entity relations:
- AND("Allergy", "narcotic medications")